下列有關 basal ganglia 功能的敘述，何者正確？
A. 對於運動系統執行已受訓練之複雜的下意識運動模式（例如投球入籃），basal ganglia 扮演重要調節角色
B. 對於骨骼肌之快速運動（例如全速賽跑，快速打字，彈奏鋼琴）之快速啟動與快速停止於適當位置，basal ganglia 扮演重要調節角色
C. 若 basal ganglia 受損，易造成 tendon reflex 消失
D. basal ganglia 主要與行為動機有關，對骨骼肌運動之執行無調節功能

正確答案：A. 對於運動系統執行已受訓練之複雜的下意識運動模式（例如投球入籃），basal ganglia 扮演重要調節角色